La prueba específica a realizar como paso previo a la inserción de un catéter en la arteria radial o cubital, con el fin de evaluar la presencia de una adecuada circulación colateral de la mano, se denomina:
1. Test de Spencer modificado.
2. Test de tolerancia al cateterismo arterial.
3. Test de Student.
4. Test de Allen.
5. Tilt Test (TTT).

Respuesta correcta: 4. Test de Allen.